Baseline systolic blood pressure (SBP) < 100 mmHg

The above is a clinical trial exclusion criterion. Annotated with entity spans:
[Temporal: Baseline] [Measurement: systolic blood pressure] ([Measurement: SBP]) [Value: < 100 mmHg]